有關混合性卵巢惡性生殖細胞瘤（mixed germ cell malignancies of the ovary），是兩種或多種生殖細胞瘤 （germ cell tumor）的混合，最常見那兩種型態的組合？
A. 無性胚胎瘤（dysgerminoma）及卵巢內胚層竇瘤（endodermal sinus tumor）
B. 無性胚胎瘤（dysgerminoma）及卵巢多胚瘤（polyembryoma）
C. 卵巢多胚瘤（polyembryoma）及不成熟畸胎瘤（immature teratoma）
D. 卵巢內胚層竇瘤（endodermal sinus tumor）及不成熟畸胎瘤（immature teratoma）

正確答案：A. 無性胚胎瘤（dysgerminoma）及卵巢內胚層竇瘤（endodermal sinus tumor）